對於完全性高位頸椎脊髓損傷病患而言，病發數週內呼吸功能的進步與下列何者最有相關？
A. 胸廓痙攣（Spasticity）
B. 咳嗽反射
C. 脊髓功能復原
D. 膈神經（Phrenic nerve）的重新支配

正確答案：A. 胸廓痙攣（Spasticity）